Clinical trial inclusion criterion:
Male participants between 18 and 40 years-old

Entity relations:
- Has_value("old", "between 18 and 40 years")